Concomitant participation in other clinical trials

The above is a clinical trial exclusion criterion. Annotated with entity spans:
[Temporal: Concomitant] [Observation: participation in other clinical trials]